下列何種藥物是屬於三價砷（arsenic），可用於治療 advanced African trypanosomiasis？
A. Dimercaprol
B. Succimer
C. Melarsoprol
D. Ferroxamine

正確答案：C. Melarsoprol